Clinical trial inclusion criterion:
Creatinine <2.0 mg/dL, or creatinine clearance >40 mL/min (as calculated by the Cockcroft-Gault method.

Entity relations:
- Has_value("creatinine clearance", ">40 mL/min")
- Has_value("Creatinine", "<2.0 mg/dL")
- Has_qualifier("creatinine clearance", "Cockcroft-Gault method")
- Has_qualifier("Creatinine", "Cockcroft-Gault method")
- OR("Creatinine", "creatinine clearance")